關於兒童急性腎衰竭，下列何者不是腎前性腎功能不全的典型實	數據表現？
A. 尿鈉< 20 mEq/L
B. 鈉離子排除分率（FENa）< 1%
C. 尿液滲透壓 > 500 mOsm/kg
D. 尿液分析可見紅血球及白血球

正確答案：D. 尿液分析可見紅血球及白血球